Clinical trial inclusion criterion:
Patient presents a normal eye fundus.

Annotated entities:
- Condition: "normal eye fundus"
- Measurement: "eye fundus"
- Value: "normal"